Prior treatment with enzalutamide or abiraterone acetate for > 14 days prior to enrollment and completion of baseline tests.

The above is a clinical trial exclusion criterion. Annotated with entity spans:
Prior [Procedure: treatment] with [Drug: enzalutamide] or [Drug: abiraterone acetate] [Multiplier: for > 14 days] [Temporal: prior to enrollment] and completion of baseline tests.